Clinical trial exclusion criterion:
Patient enrolled in the study within the past 72 hours

Entity relations:
- Has_temporal("enrolled in the study", "within the past 72 hours")